Clinical trial inclusion criterion:
ADHD is diagnosed according to Diagnostic and Statistical Manual of Mental Disorders, fifth edition (DSM-5 criteria).

Entity relations:
- Has_qualifier("ADHD", "DSM-5")